Clinical trial inclusion criterion:
Alanine transaminase (ALT) (SGPT) ≤ 2.5 X institutional ULN

Annotated entities:
- Measurement: "Alanine transaminase (ALT) (SGPT)"
- Value: "≤ 2.5 X institutional ULN"